有關心血管系統，下列敘述何者錯誤？
A. 有些心房心肌細胞含有顆粒
B. 心室間隔膜狀區（membranous portion）是由結締組織構成
C. 心室間隔或心房間隔表層皆無內皮細胞
D. 心室間隔的膜狀區內含有 A-V 束（A-V bundle）

正確答案：C. 心室間隔或心房間隔表層皆無內皮細胞